關於流行性感冒的敘述，何者錯誤？
A. 1918 年全球大流行是由 B 型流行性感冒病毒 H1N1 型所引起的
B. 1997 年香港禽流感是由 A 型流感病毒 H5N1 型所引起的
C. A 型流感病毒基因體是由 8 段 RNA 片斷所組成的
D. 溫帶地區流感高峰期是在冬天，熱帶地區整年皆有病例發生

正確答案：A. 1918 年全球大流行是由 B 型流行性感冒病毒 H1N1 型所引起的